Clinical trial exclusion criterion:
Has had esophageal or gastric variceal bleeding within the last 6 months

Annotated entities:
- Condition: "esophageal variceal bleeding"
- Condition: "gastric variceal bleeding"
- Temporal: "within the last 6 months"